What eye disease(s) are associated with ocular toxoplasmosis?

Diseases associated with ocular toxoplasmosis are ocular syphilis, retinochoroiditis, juvenile idiopathic arthritis and chorioretinitis.